Clinical trial exclusion criterion:
pectus carinatum, Poland's syndrome, or any chest wall anomaly other than pectus excavatum

Annotated entities:
- Condition: "pectus carinatum"
- Condition: "Poland's syndrome"
- Condition: "chest wall anomaly"
- Negation: "other than"
- Condition: "pectus excavatum"